關於纖維肌肉發育不良（fibromuscular dysplasia）所導致之腎動脈狹窄，以下何者最不可能發生？
A. 女性較多
B. 好發年齡為20至40歲
C. 僅會侵犯血管中層
D. 腎臟呈現缺血性萎縮

正確答案：C. 僅會侵犯血管中層